Clinical trial exclusion criterion:
Pathological dry eye or associated findings

Entity relations:
- AND("associated findings", "Pathological dry eye")
- OR("Pathological dry eye", "associated findings")